一名 55 歲男性，因為嚴重胸痛送醫，12 小時後不幸死亡，解剖發現左心室心肌層切片中有一染色較紅區域，其中心肌細胞的細胞核及橫紋消失。此外，並沒有明顯出血或發炎細胞浸潤。下列何種情況最可能造成其心臟的變化？
A. 病毒感染
B. 冠狀動脈阻塞
C. 槍傷
D. 敗血症

正確答案：B. 冠狀動脈阻塞